Clinical trial inclusion criterion:
Gave informed consent

Annotated entities:
- Informed_consent: "Gave informed consent"